Un varón de 67 años, esquizofrénico en tratamiento médico, es atendido en una ciudad del Sur de España el 15 de agosto por presentar fiebre y deterioro del nivel de consciencia. A la exploración, presenta una puntuación de la escala de coma de Glasgow de 5 puntos, taquipnea a 45 respiraciones por minuto, saturación de oxigeno por pulsioximetría de 75%, temperatura rectal de 41 ºC, y en la analítica la CPK es de 30.000 U/L. Se realiza una punción lumbar que es normal. Señale la respuesta correcta:
1. El enfriamiento sumergiendo al paciente en una bañera con hielo es el método más seguro para reducir la temperatura.
2. No es preciso sedar al paciente, intubarlo y conectarlo a ventilación mecánica.
3. La afectación hepática es rara en esta patología.
4. En caso de hipotensión se debe utilizar dopamina a dosis superiores a 10 microgramos/kg/minuto.
5. El cerebelo es especialmente sensible a la temperatura elevada por encima de 40 grados.

Respuesta correcta: 5. El cerebelo es especialmente sensible a la temperatura elevada por encima de 40 grados.